Any condition which, in the opinion of the investigator, prevents the subject from participation in the study.

The above is a clinical trial exclusion criterion. Annotated with entity spans:
[Non-representable: Any condition which, in the opinion of the investigator, prevents the subject from participation in the study.]